Clinical trial inclusion criterion:
Patient is currently benefiting from the treatment with pasireotide, as determined by the investigator

Annotated entities:
- Non-query-able: "Patient is currently benefiting from the treatment with pasireotide, as determined by the investigator"